Clinical trial exclusion criterion:
contraindications for trial drugs

Entity relations:
- Has_qualifier("drugs", "trial")
- Has_mood("drugs", "contraindications for")